Clinical trial exclusion criterion:
do not use tamoxifen or aromatase inhibitor

Entity relations:
- Has_negation("tamoxifen", "not")
- OR("tamoxifen", "aromatase inhibitor")